Which class of genes are mutated in Diamond Blackfan Anemia patients?

Diamond-Blackfan Anemia (DBA) is characterized by a defect of erythroid progenitors and, clinically, by anemia and malformations. Diamond Blackfan anemia (DBA) is an inherited erythroblastopenia associated with mutations in at least 8 different ribosomal protein genes. Diamond-Blackfan anemia (DBA) is a rare congenital disease affecting erythroid precursor differentiation. Diamond-Blackfan anemia (DBA) is a congenital disease characterized by defective erythroid progenitor maturation and physical malformations.